Se organiza un programa de Educación para la Salud (EpS) grupal dirigido a mujeres en la etapa del climaterio. Una de las sesiones tiene como objetivo conocer cómo están viviendo dicha etapa y cómo les está afectando a nivel personal y familiar. La técnica de EpS más adecuada es:
1. Rejilla.
2. Tormenta de ideas.
3. Phillips 6/6.
4. Fotopalabra.
5. Todas son adecuadas.

Respuesta correcta: 5. Todas son adecuadas.